Clinical trial exclusion criterion:
Patients taking antipsychotics, mood stabilizer or any psychotropic medications besides antidepressants, except benzodiazepines or beta blockers or hypnotics

Annotated entities:
- Drug: "antipsychotics"
- Drug: "mood stabilizer"
- Drug: "psychotropic medications"
- Negation: "besides"
- Drug: "antidepressants"
- Negation: "except"
- Drug: "benzodiazepines"
- Drug: "beta blockers"
- Drug: "hypnotics"